Clinical trial inclusion criterion:
6. Each volunteer must have a valid social security number

Annotated entities:
- Parsing_Error: "6."
- Post-eligibility: "Each volunteer must have a valid social security number"
- Non-query-able: "Each volunteer must have a valid social security number"